Informed consent explained to, understood by and signed by patient/guardian. Patient/guardian given copy of informed consent.

The above is a clinical trial inclusion criterion. Annotated with entity spans:
[Post-eligibility: Informed consent explained to, understood by and signed by patient/guardian. Patient/guardian given copy of informed consent.]